Clinical trial inclusion criterion:
2. Healthy, premenopausal female age 18-47;

Annotated entities:
- Parsing_Error: "2."
- Condition: "Healthy"
- Condition: "premenopausal"
- Person: "female"
- Person: "age"
- Value: "18-47"